SLEDAI >/= 6 at screening visit

The above is a clinical trial inclusion criterion. Annotated with entity spans:
[Measurement: SLEDAI] [Value: >/= 6] [Temporal: at screening visit]